Clinical trial inclusion criterion:
Participants must present a diagnosis of osteoporosis based on DXA measurement of the bone mineral density at the femur neck and/or total hip and/or lumbar spine (T value 2.5 SD or more below the young female adult mean) within the past 24 months.

Entity relations:
- AND("DXA", "bone mineral density")
- Has_qualifier("bone mineral density", "femur neck")
- AND("osteoporosis", "DXA")
- Has_temporal("osteoporosis", "past 24 months")
- Has_value("T value", "2.5 SD or more below the young female adult mean")
- AND("bone mineral density", "T value")
- OR("femur neck", "total hip", "lumbar spine")